History of statin intolerance to any other drug.

The above is a clinical trial exclusion criterion. Annotated with entity spans:
History of [Drug: statin] [Condition: intolerance] to any other drug.